Clinical trial exclusion criterion:
Patients with any neoplasm except localized skin cancer and who is receiving adequate treatment.

Entity relations:
- Has_negation("localized skin cancer", "except")
- AND("neoplasm", "localized skin cancer")